What is a potential alternate uses(repositioning) for Primaquine

Primaquine Diphosphate, a Known Antimalarial Drug, Blocks Vascular Leakage Acting Through Junction Stabilization.  PD could be used as a novel drug for vascular leakage by maintaining endothelial integrity